處理縱膈腔生殖細胞瘤，抽血檢查胎兒球蛋白（alpha fetal protein）及絨毛膜激素（beta-HCG），下列之敘 述何者錯誤？
A. 精原細胞瘤（seminoma）的血清胎兒球蛋白及絨毛膜激素指數顯著昇高
B. 此二項檢查可作為精原細胞瘤（seminoma）及非精原細胞瘤（nonseminomatous germ cell tumor）的鑑別
C. 此二項檢查可評估化學治療的效果
D. 定期偵測此二項指數可早期發現腫瘤的復發

正確答案：A. 精原細胞瘤（seminoma）的血清胎兒球蛋白及絨毛膜激素指數顯著昇高